Clinical trial exclusion criterion:
current or past diagnosis of bipolar and other related disorders, schizophrenia spectrum, or other psychotic disorders

Annotated entities:
- Condition: "bipolar"
- Qualifier: "other"
- Condition: "related disorders"
- Condition: "schizophrenia spectrum"
- Condition: "psychotic disorders"